Clinical trial exclusion criterion:
Need for long-term oral anticoagulation;

Entity relations:
- Has_mood("long-term oral anticoagulation", "Need for")